Clinical trial exclusion criterion:
Patients presenting midline hernia.

Annotated entities:
- Condition: "midline hernia"